Known cerebral/meningeal disease including signs or symptoms of progressive multifocal leukoencephalopathy (PML)

The above is a clinical trial exclusion criterion. Annotated with entity spans:
Known [Condition: cerebral]/[Condition: meningeal disease] including signs or symptoms of [Condition: progressive multifocal leukoencephalopathy] ([Condition: PML])